Use of any of the following medications within two weeks of randomization: MAO inhibitors, Calcium channel blockers, alpha blockers, beta blockers, disopyramide, flecainide, encainide, moricizine, propafenone, sotalol, or beta adrenergic agonists

The above is a clinical trial exclusion criterion. Annotated with entity spans:
Use of any of the following medications [Temporal: within two weeks of randomization]: [Drug: MAO inhibitors], [Drug: Calcium channel blockers], [Drug: alpha blockers], [Drug: beta blockers], [Drug: disopyramide], [Drug: flecainide], [Drug: encainide], [Drug: moricizine], [Drug: propafenone], [Drug: sotalol], or [Drug: beta adrenergic agonists]